premenopausal women

The above is a clinical trial inclusion criterion. Annotated with entity spans:
[Condition: premenopausal] [Person: women]